Clinical trial inclusion criterion:
Estimated weight loss less than or equal to 10% in the 3 months before study randomization

Annotated entities:
- Temporal: "3 months before study randomization"
- Reference_point: "study randomization"
- Measurement: "Estimated weight loss"
- Value: "equal to 10%"
- Value: "less than 10%"